Which lncRNAS are regulated by SAM68?

Hotair, Mir155hg, as well as SR-lncRNA-1 and SR-lncRNA-2 are regulated by Sam68, and contained consensus Sam68 binding sites.